Clinical trial exclusion criterion:
Ongoing treatment with statins, fibrates, and/or cation exchange resins within 2 weeks;

Annotated entities:
- Drug: "statins"
- Drug: "fibrates"
- Temporal: "Ongoing"
- Procedure: "treatment"
- Drug: "cation exchange resins"
- Temporal: "within 2 weeks"